Normal cognitive function in order to sign written, informed consent and to understand trial protocol

The above is a clinical trial inclusion criterion. Annotated with entity spans:
N[Post-eligibility: ormal cognitive function in order to sign written, informed consent and to understand trial protoco]l